Clinical trial exclusion criterion:
acute narrow angle glaucoma

Entity relations:
- Has_qualifier("narrow angle glaucoma", "acute")